6. Negative pregnancy test

The above is a clinical trial inclusion criterion. Annotated with entity spans:
6. [Value: Negative] [Measurement: pregnancy test]